History of other malignancy within the last 5 years, except for appropriately treated carcinoma in situ of the cervix, non-melanoma skin carcinoma, Stage I uterine cancer, or other cancers with a similar outcome as those previously mentioned.

The above is a clinical trial exclusion criterion. Annotated with entity spans:
History of [Qualifier: other] [Condition: malignancy] [Temporal: within the last 5 years], [Negation: except for] [Qualifier: appropriately treated] [Condition: carcinoma in situ of the cervix], [Condition: non-melanoma skin carcinoma], [Measurement: Stage] [Value: I] [Condition: uterine cancer], [Non-representable: or other cancers with a similar outcome as those previously mentioned].